神經細胞動作電位（action potential）發生過程中，膜電位去極化（depolarization）達電位尖峰（peak）時，下列何項敘述正確？
A. 胞膜內鉀離子濃度大量減少
B. 胞膜內鈉離子濃度大量減少
C. 胞膜外鈉離子濃度遠大於胞膜內鈉離子濃度
D. 胞膜內鉀離子濃度遠小於胞膜外鉀離子濃度

正確答案：C. 胞膜外鈉離子濃度遠大於胞膜內鈉離子濃度